Clinical trial exclusion criterion:
Blood disorders or coagulopathy.

Entity relations:
- OR("Blood disorders", "coagulopathy")